Unwillingness to participate in the study with additional imaging protocols

The above is a clinical trial exclusion criterion. Annotated with entity spans:
[Informed_consent: Unwillingness to participate in the study with additional imaging protocols]